在前臂，下列何者最可能與前臂外側皮神經（lateral cutaneous nerve of forearm）靠近或伴行？
A. 頭靜脈（cephalic vein）
B. 貴要靜脈（basilic vein）
C. 正中肘靜脈（median cubital vein）
D. 肱靜脈（brachial vein）

正確答案：A. 頭靜脈（cephalic vein）